What is the function of the TFIIS transcriptional factor (Dst1) in yeast?

TFIIS, an elongation factor encoded by DST1 in Saccharomyces cerevisiae, stimulates transcript cleavage in arrested RNA polymerase II. Co-immunoprecipitation experiments showed that TFIIS can bind the Cdk8 module and SAGA in cell-free extracts Members of the SAGA and Mediator complexes are partners of the transcription elongation factor TFIIS.  TFIIS and Pol III occupancies correlated well genome-wide on this novel class of targets. These data provide strong in vivo and in vitro evidence in favor of a role of TFIIS as a general Pol III transcription factor. Transcription factor IIS (TFIIS) stimulates RNA cleavage by RNA polymerase II by allowing backtracked enzymes to resume transcription elongation.